Clinical trial exclusion criterion:
7. Have an ALT/AST>3x upper limit of normal.

Entity relations:
- Has_value("ALT/AST", ">3x upper limit of normal")